Clinical trial exclusion criterion:
Intolerance or allergy to ASA, clopidogrel or ticlopidine precluding treatment for 12 months

Entity relations:
- Has_temporal("treatment", "for 12 months")
- Has_negation("treatment", "precluding")
- AND("ASA", "treatment")
- AND("Intolerance", "ASA")
- OR("Intolerance", "allergy")
- OR("ASA", "clopidogrel", "ticlopidine")